serious surgery within 30 days

The above is a clinical trial exclusion criterion. Annotated with entity spans:
[Qualifier: serious] [Procedure: surgery] [Temporal: within 30 days]